Which gene has been implicated in Majeed Syndrome?

Genetic alteration of LPIN2 in humans is known to cause Majeed syndrome.